What is the function of a protein degron?

A protein degron is a protein that is attached to the N-terminus of a protein of interest. The N-degron then targets itself and the attached protein for rapid proteasomal degradation through a N-end rule pathway. The degradation pathway is a pathway in which proteins are fused to a degron that removes itself in an absence of drug, resulting in an untamable protein.